Clinical trial inclusion criterion:
Uni-dimensionally measurable disease according to Response Evaluation Criteria in Solid Tumours (RECIST) v1.1

Annotated entities:
- Measurement: "Response Evaluation Criteria in Solid Tumours (RECIST) v1.1"
- Value: "Uni-dimensionally measurable"
- Condition: "disease"
- Context_Error: "disease"